Clinical trial inclusion criterion:
18 years or older patients who are proven to be infected by Helicobacter pylori based on positive in Urea Breath Test or positive in histopathologic examination of biopsy in antrum and corpus of gaster through esophagoduodenoscopy.

Entity relations:
- Has_value("Urea Breath Test", "positive")
- Has_value("histopathologic examination of biopsy", "positive")
- Has_qualifier("histopathologic examination of biopsy", "antrum of gaster")
- Has_qualifier("histopathologic examination of biopsy", "corpus of gaster")
- AND("esophagoduodenoscopy", "histopathologic examination of biopsy")
- Has_value("old", "18 years or older")
- OR("Urea Breath Test", "esophagoduodenoscopy")